Stent placement within the previous 6 months

The above is a clinical trial exclusion criterion. Annotated with entity spans:
[Device: Stent] [Procedure: placement] [Temporal: within the previous 6 months]